Clinical trial exclusion criterion:
history of substance abuse (except painkillers)

Entity relations:
- Has_negation("painkillers", "except")